Inadequate RBC mass based on TBV <4500 ml (above) or screening Hb <14 g/dL

The above is a clinical trial exclusion criterion. Annotated with entity spans:
[Qualifier: Inadequate] [Observation: RBC mass] based on [Measurement: TBV] [Value: <4500 ml] (above) or screening [Measurement: Hb] [Value: <14 g/dL]